El “Curso para el afrontamiento de la depresión” (CAD) de Lewinsohn es un programa de tratamiento de la depresión:
1. Específico para adolescentes.
2. Diseñado con un programa educativo para ser realizado individualmente.
3. Consistente en una modalidad de la terapia cognitiva de Beck para su aplicación en grupos.
4. Dirigido a enseñar ciertas habilidades como, por ejemplo, el aumento de actividades agradables y las habilidades sociales.
5. Altamente estructurado y breve, con una duración de solo 6 sesiones.

Respuesta correcta: 4. Dirigido a enseñar ciertas habilidades como, por ejemplo, el aumento de actividades agradables y las habilidades sociales.